培養糠秕馬拉癬菌（Malassezia furfur）時，為提高培養率，最常於培養基中加入下列何者？
A. 澱粉（Starch）
B. L-半胱胺酸（L-cysteine）
C. 橄欖油（Olive oil）
D. N-乙醯葡萄胺糖（N-acetylglucosamine）

正確答案：C. 橄欖油（Olive oil）